Other skin diseases that might interfere with the efficacy evaluation;

The above is a clinical trial exclusion criterion. Annotated with entity spans:
Other [Condition: skin diseases] that might [Qualifier: interfere with the efficacy evaluation];